人體之免疫機轉中，下列何者屬 adaptive immunity？
A. Antigen-presenting cells
B. Complement system
C. Natural killer cells
D. Granulocyte oxidase activity

正確答案：A. Antigen-presenting cells